下列有關額葉癲癇（frontal lobe epilepsy）的描述何者錯誤？
A. 癲癇發作（seizure）短暫，可能不會有癲癇發作後混亂（postictal confusion）
B. 腦波圖（scalp EEG）可能看不出明顯異常
C. 癲癇發作傾向在晚上睡眠中
D. phenytoin為治療首選藥物

正確答案：D. phenytoin為治療首選藥物